Clinical trial inclusion criterion:
Patient meets ONE of the following criteria: baseline PSA < 4.0ng/mL (no prostate biopsy required) OR baseline PSA >/= 4 ng/mL AND a negative prostate biopsy (minimum 12 core biopsy) within the prior 12 months

Entity relations:
- Has_temporal("PSA", "baseline")
- Has_value("PSA", "< 4.0ng/mL")
- Has_temporal("PSA", "baseline")
- Has_value("prostate biopsy", "negative")
- Has_value("PSA", ">/= 4 ng/mL")
- Has_multiplier("core biopsy", "minimum 12")
- Has_temporal("PSA", "within the prior 12 months")
- Has_temporal("prostate biopsy", "within the prior 12 months")
- Has_temporal("core biopsy", "within the prior 12 months")
- OR("PSA", "PSA")